某研究比較四組不同年齡層的病人之平均血壓值達統計顯 差異，進一步進行多重比較方法檢定所有可能的兩兩組別比較，假設犯型一錯誤的總機率為 0.05，則利用 Bonferroni 法修正每一個別檢定的顯 性水準為：
A. 0.05
B. 0.05/4
C. 0.05/6
D. 0.05/12

正確答案：C. 0.05/6